Clinical trial inclusion criterion:
Requires VTE thromboprophylaxis

Entity relations:
- AND("thromboprophylaxis", "VTE")